一位 60 歲男性病人因在診所發現有心律不整被轉診至區域醫院急診，檢驗顯示病人之鉀離子為 0 mEq/L，下列藥物何者不是治療的優先考量？
A. Calcium chloride
B. Insulin plus glucose
C. Sodium bicarbonate
D. Atropine

正確答案：D. Atropine